Clinical trial inclusion criterion:
Subjects must exhibit willingness, physiologic capability, and an educational level sufficient to comply with all protocol procedures.

Annotated entities:
- Post-eligibility: "Subjects must exhibit willingness, physiologic capability, and an educational level sufficient to comply with all protocol procedures."